¿De qué naturaleza son los anticuerpos inmunes que pueden provocar enfermedad hemolítica del recién nacido en casos de incompatibilidad fetomaterna?
1. IgM.
2. IgA.
3. IgE.
4. IgG.

Respuesta correcta: 4. IgG.